Male or female subjects aged =18 to =65 years

The above is a clinical trial inclusion criterion. Annotated with entity spans:
[Person: Male] or [Person: female] subjects [Person: aged] [Value: =18 to =65 years]